What is the effect of Dkk1 in Wnt signaling?

DKK1 is a secreted protein that inhibits WNT signaling and plays essential roles in vertebrate embryogenesis.